Clinical trial exclusion criterion:
Poorly controlled hypertension

Annotated entities:
- Qualifier: "Poorly controlled"
- Condition: "hypertension"